What is the role of KAT7 in AML?

KAT7 is a genetic vulnerability of acute myeloid leukemias driven by MLL rearrangements.